Clinical trial exclusion criterion:
20. Use of any investigational drug or therapy within 28 days before screening

Entity relations:
- Has_index("within 28 days before screening", "screening")
- OR("investigational drug", "investigational therapy")